Kellgren-Lawrence score at X-ray evaluation > 3;

The above is a clinical trial exclusion criterion. Annotated with entity spans:
[Measurement: Kellgren-Lawrence score] at [Procedure: X-ray evaluation] [Value: > 3];